For women of childbearing potential and men with partners of childbearing potential, agreement to use a highly effective, non-hormonal form of contraception or 2 effective forms of non-hormonal contraception by the patient and/or partner. Contraception use must continue for the duration of study treatment and for at least 6 months after the last dose of study treatment. Male patients whose partners are pregnant should use condoms for the duration of the study.

The above is a clinical trial inclusion criterion. Annotated with entity spans:
For [Person: women] of [Condition: childbearing potential] and [Person: men] [Observation: with partners of childbearing potential], agreement to use a [Qualifier: highly effective], [Qualifier: non-hormonal] form of [Procedure: contraception] or [Multiplier: 2] effective forms of [Procedure: non-hormonal contraception] by the patient and/or partner. [Procedure: Contraception] use must [Temporal: continue for the duration of study treatment] and [Temporal: for at least 6 months after the last dose of study treatment]. [Person: Male] patients whose [Observation: partners are pregnant] should use [Device: condoms] [Temporal: for the duration of the study].